Clinical trial exclusion criterion:
History of major gastrointestinal tract surgery such as gastrectomy, gastroenterostomy, or bowel resection

Annotated entities:
- Temporal: "History"
- Condition: "major gastrointestinal tract surgery"
- Procedure: "gastrectomy"
- Procedure: "gastroenterostomy"
- Procedure: "bowel resection"